Clinical trial exclusion criteria:
underlying lung or heart disase
contra indication to dexamethasone
immune deficient state
preterm birth
previous intubation or apnea history

Annotated entities:
- Condition: "heart disase"
- Condition: "lung disase"
- Drug: "dexamethasone"
- Condition: "contra indication"
- Condition: "immune deficient state"
- Condition: "preterm birth"
- Procedure: "intubation"
- Condition: "apnea"
- Temporal: "history"
- Temporal: "previous"